有關人類骨折（fracture）復健的原則，下列何者錯誤？
A. 對於骨折病人，未加固定的關節應儘早運動
B. 對老年人而言，步態訓練時先使用助行器（walker）
C. 急性期骨折處局部熱療可減緩疼痛，降低肌肉痙攣（spasm）
D. 對於骨折病人，適當增加負重（weight bearing）可促進骨折癒合

正確答案：C. 急性期骨折處局部熱療可減緩疼痛，降低肌肉痙攣（spasm）